History of significant neurologic or psychiatric disorders including dementia or seizures

The above is a clinical trial exclusion criterion. Annotated with entity spans:
[Temporal: History] of significant [Condition: neurologic] or [Condition: psychiatric disorders] including [Condition: dementia] or [Condition: seizures]